Serum albumin level less than 2 g / dL

The above is a clinical trial exclusion criterion. Annotated with entity spans:
[Measurement: Serum albumin level] l[Value: ess than 2 g / dL]